PSA criteria:

The above is a clinical trial inclusion criterion. Annotated with entity spans:
[Non-representable: PSA criteria]: